Hereditary angioneurotic edema 的成因是：
A. 因缺乏補體 C1 之 inhibitor，引起過多 bradykinin 及 C2 kinin 生成
B. 因缺乏 purine nucleoside phosphorylase，因此增加 vascular leakage
C. 過高的 IgG1 活化引起 C2, C4 活性過高，而增加血管通透性
D. 過高的 properdin 及 factor D 引起過高的血管通透性

正確答案：A. 因缺乏補體 C1 之 inhibitor，引起過多 bradykinin 及 C2 kinin 生成